are on other studies requiring blood draws that might exceed 450 mL total during the period of the influenza vaccine study

The above is a clinical trial exclusion criterion. Annotated with entity spans:
[Competing_trial: are on other studies requiring blood draws that might exceed 450 mL total during the period of the influenza vaccine study]